Mujer de 25 años que ingresa en el hospital con palidez cutánea, cansancio y malestar generalizado. Presenta valores ligeramente disminuidos de volumen corpuscular medio y hemoglobina, sideremia 70 g/dl, ferritina 50 ng/ml, y en la electroforesis de hemoglobinas un aumento significativo de la fracción HbA2 con HbF normal. Con estos datos puede tratarse de:
1. Anemia ferropénica.
2. Anemia de los procesos crónicos.
3. Policitemia Vera.
4. Beta Talasemia Minor.
5. Leucemia mieloide crónica.

Respuesta correcta: 4. Beta Talasemia Minor.